下列何種中風危險因子的控制，最能有效的減少腦中風的再發生率？
A. 高血壓以降血壓藥物治療
B. 高血脂以statin治療
C. 心房顫動以抗凝血劑（如warfarin）治療
D. 頸動脈狹窄以支架置放治療

正確答案：C. 心房顫動以抗凝血劑（如warfarin）治療